Clinical trial exclusion criterion:
Patient is currently enrolled in another clinical trial

Entity relations:
- Has_temporal("enrolled in another clinical trial", "currently")